下列何種口腔病灶最容易演變為	狀細胞癌（squamous cell carcinoma）？
A. 白斑（leukoplakia）
B. 紅斑（erythroplakia）
C. 毛狀白斑（hairy leukoplakia）
D. 口瘡性潰瘍（aphthous ulcer）

正確答案：B. 紅斑（erythroplakia）